當一位孩童的腹部摸到腫塊（abdominal mass）時，應先作下列何種檢查以鑑別診斷？
A. 電腦斷層（CT）
B. 超音波（sonography）
C. 靜脈腎盂攝影（IVP）
D. 血管攝影（angiography）

正確答案：B. 超音波（sonography）